Clinical trial exclusion criterion:
alcohol abuse

Annotated entities:
- Condition: "alcohol abuse"